patient refusal

The above is a clinical trial exclusion criterion. Annotated with entity spans:
[Observation: patient refusal]